taken of corticosteroid in the last month

The above is a clinical trial exclusion criterion. Annotated with entity spans:
taken of [Drug: corticosteroid] in the [Temporal: last month]